下列何者在小腿沒有神經伴行？
A. 脛後動脈（posterior tibial artery）
B. 脛前動脈（anterior tibial artery）
C. 腓動脈（peroneal artery）
D. 小隱靜脈（small saphenous vein）

正確答案：C. 腓動脈（peroneal artery）